Clinical trial exclusion criterion:
Use of Traditional Chinese Medication or alternative therapies

Entity relations:
- OR("Traditional Chinese Medication", "alternative therapies")